Clinical trial exclusion criterion:
Decompensated cirrhosis defined by the presence of actual or previous history of clinical decompensation including ascites, hepatic encephalopathy, variceal bleeding or spontaneous bacterial peritonitis, or a Child-Pugh B or C.

Annotated entities:
- Condition: "cirrhosis"
- Qualifier: "Decompensated"
- Condition: "clinical decompensation"
- Undefined_semantics: "clinical decompensation"
- Condition: "ascites"
- Condition: "hepatic encephalopathy"
- Condition: "variceal bleeding"
- Condition: "spontaneous bacterial peritonitis"
- Measurement: "Child-Pugh"
- Value: "B or C"
- Temporal: "actual"
- Temporal: "previous"